Clinical trial exclusion criteria:
Born prior to 34 weeks
Neonatal intensive care unit admission
Serious medical comorbidities
Primary substance exposure in-utero was buprenorphine, or was not opioids

Annotated entities:
- Person: "Born"
- Value: "prior to 34 weeks"
- Visit: "Neonatal intensive care unit"
- Condition: "medical comorbidities"
- Qualifier: "Serious"
- Observation: "substance exposure"
- Qualifier: "in-utero"
- Qualifier: "buprenorphine"
- Negation: "not"
- Drug: "opioids"